當嚴重外傷病人於急診治療，最常見致命性的死因為嚴重腦外傷及出血性休克。身體中，下列之體腔（body cavity）容易積血而造成早期死亡，但何者除外？
A. 胸腔（thoracic cavity）
B. 腹腔（abdominal cavity）
C. 骨盆腔（pelvic cavity）
D. 後腹膜腔（retroperitoneal cavity）

正確答案：D. 後腹膜腔（retroperitoneal cavity）